Indique la causa que impide obtener un reactivo de Grignard al reaccionar magnesio con 4bromo-1-pentanol en dietiléter:
1. Escasa solubilidad de los reactivos.
2. El precursor orgánico reacciona con el disolvente.
3. Se requiere la adición de un catalizador ácido.
4. El hidroxilo reacciona con el reactivo de Grignard formado.

Respuesta correcta: 4. El hidroxilo reacciona con el reactivo de Grignard formado.